下列何者不參與形成鼻腔頂部？
A. 額骨（frontal）
B. 上頜骨（maxilla）
C. 篩骨（ethmoid）
D. 蝶骨（sphenoid）

正確答案：B. 上頜骨（maxilla）